Clinical trial inclusion criterion:
Medically and neurologically healthy on the basis of physical examination and medical history.

Entity relations:
- AND("neurologically healthy", "physical examination")
- AND("neurologically healthy", "Medically healthy")
- AND("physical examination", "medical history")